La aldosterona:
1. Actúa en todos los túbulos de la nefrona con la misma intensidad.
2. Disminuye la actividad Na+/K+/ATPasa.
3. Estimula la síntesis de canales de Na+.
4. Es una hormona peptídica.

Respuesta correcta: 3. Estimula la síntesis de canales de Na+.